Clinical trial exclusion criterion:
a. History of any significant chronic disease and/or hepatitis. b. History of drug and/or alcohol abuse. c. Acute illness at the time of either the prestudy medical evaluation or dosing.

Entity relations:
- Has_qualifier("chronic disease", "significant")
- Has_qualifier("hepatitis", "significant")
- Has_temporal("chronic disease", "History")
- Has_temporal("alcohol abuse", "History")
- Has_temporal("drug abuse", "History")
- OR("chronic disease", "hepatitis")
- OR("drug abuse", "alcohol abuse")